下列關於胱氨酸結石（cystine stone）的敘述，何者錯誤？
A. 自體隱性遺傳（autosomal recessive）
B. 發生率為 1～2%
C. 預防結石生長及復發要酸化尿液
D. 沒有已知的結石抑制因子

正確答案：C. 預防結石生長及復發要酸化尿液